El germen que produce con mayor frecuencia bursitis séptica es:
1. Estreptococo viridans.
2. Estafilococo aureus.
3. Neisseria gonorrhoeae.
4. Estreptococo pneumoniae.

Respuesta correcta: 2. Estafilococo aureus.